上呼吸道感染（一般感冒）的最適當治療為何？
A. 抗病毒藥
B. 抗細菌藥（抗生素）
C. 類固醇
D. 症狀治療

正確答案：D. 症狀治療